En los métodos cinéticos de análisis:
1. Pueden emplearse reacciones lentas.
2. Es necesario que la reacción se complete para poder obtener los datos de las concentraciones en el equilibrio.
3. Pueden determinarse bajas concentraciones de un catalizador siempre que la velocidad de la reacción no dependa de la concentración del mismo.
4. No es necesario un control riguroso de las condiciones experimentales.
5. Pueden determinarse mezclas de analitos siempre que todos ellos reaccionen con un mismo reactivo a la misma velocidad de reacción.

Respuesta correcta: 1. Pueden emplearse reacciones lentas.